4. Onset > 6 months

The above is a clinical trial inclusion criterion. Annotated with entity spans:
[Parsing_Error: 4.] [Temporal: Onset > 6 months]